Clinical trial inclusion criterion:
Patients with 2 or more interproximal sites (not on same tooth) with probing pocket depths of 5mm or more and 2 or more interproximal sites (not on same tooth)of probing attachment loss of 4mm or more which bled on probing.

Annotated entities:
- Multiplier: "2 or more"
- Condition: "interproximal sites with probing pocket depths of 5mm or more"
- Value: "5mm or more"
- Multiplier: "2 or more"
- Condition: "interproximal sites of probing attachment loss of 4mm or more"
- Value: "4mm or more"
- Qualifier: "bled on probing"
- Procedure: "probing"